Clinical trial inclusion criterion:
Physicians Global Assessment score of 3 or 4 at baseline

Entity relations:
- Has_value("Physicians Global Assessment score", "3")
- Has_temporal("Physicians Global Assessment score", "at baseline")
- OR("3", "4")